Significant renal dysfunction (see also exclusion criteria laboratory abnormalities).

The above is a clinical trial exclusion criterion. Annotated with entity spans:
[Qualifier: Significant] [Condition: renal dysfunction] [Non-representable: (see also exclusion criteria laboratory abnormalities)].